Clinical trial inclusion criterion:
With hot flashes and with or without active sexual life.

Entity relations:
- OR("with active sexual life", "without active sexual life")